La Terapia Interpersonal Reconstructiva de Benjamin incluye como uno de los aspectos más relevantes en el tratamiento de los trastornos de la personalidad:
1. La terapia cognitiva.
2. La terapia de grupo.
3. La terapia de exposición.
4. La solución de problemas emocionales.
5. El análisis estructural de la conducta social.

Respuesta correcta: 5. El análisis estructural de la conducta social.